Clinical trial exclusion criterion:
Pyonephrosis requiring drainage

Annotated entities:
- Condition: "Pyonephrosis"
- Mood: "requiring"
- Procedure: "drainage"